Clinical trial exclusion criterion:
Active cancer

Annotated entities:
- Condition: "cancer"
- Temporal: "Active"